關於甲狀腺乳突癌（papillary carcinoma），何者正確？
A. 男性較女性發生率高
B. 較多肺轉移，較少淋巴轉移
C. 較少多發性
D. 高細胞（tall）、島細胞（insular）、圓柱形細胞（columnar）之類型預後較差

正確答案：D. 高細胞（tall）、島細胞（insular）、圓柱形細胞（columnar）之類型預後較差